Clinical trial inclusion criteria:
Males or non-pregnant, non-nursing females between the ages of 2-65 years
LTBI diagnosis as per Canadian TB Standards using either the Tuberculin Skin Test (TST) or the Interferon Gamma Release Assay (IGRA)
Children 2-5 years with negative TSTs who have been in close contact with a case of active TB disease recently
Able and willing to provide fully informed consent or parent/guardian able to provide consent

Annotated entities:
- Person: "Males"
- Pregnancy_considerations: "non-pregnant, non-nursing"
- Person: "females"
- Person: "ages"
- Value: "2-65 years"
- Condition: "LTBI"
- Measurement: "Tuberculin Skin Test"
- Measurement: "TST"
- Measurement: "Interferon Gamma Release Assay"
- Measurement: "IGRA"
- Person: "Children"
- Person: "years"
- Value: "2-5"
- Measurement: "TSTs"
- Value: "negative"
- Non-query-able: "who have been in close contact with a case of active TB disease recently"
- Informed_consent: "Able and willing to provide fully informed consent or parent/guardian able to provide consent"